在骨盆腔內下列何者跨過輸尿管？
A. 輸卵管（ovarian tube）
B. 輸精管（vas deferens）
C. 陰道動脈（vaginal artery）
D. 陰部內動脈（internal pudendal artery）

正確答案：B. 輸精管（vas deferens）